Hepatic disease or biliary tract obstruction, or significant hepatic enzyme elevation (ALT or AST > 3 times upper limit of normal).

The above is a clinical trial exclusion criterion. Annotated with entity spans:
[Condition: Hepatic disease] or [Condition: biliary tract obstruction], or [Qualifier: significant] [Condition: hepatic enzyme elevation] ([Measurement: ALT] or [Measurement: AST] [Value: > 3 times upper limit of normal]).